Clinical trial inclusion criterion:
No contraindications to general and regional anesthesia

Entity relations:
- AND("contraindications", "regional anesthesia")
- Has_negation("contraindications", "No")
- AND("contraindications", "general anesthesia")